今年 55 歲的李先生 5 年前診斷為肝細胞癌，經手術治療後不幸局部腫瘤復發並轉移至胸椎，壓迫脊髓造成下肢癱瘓，背部嚴重疼痛，接受安寧緩和醫療近一年，期間曾四次住院，其餘時間在家休養 ，由居家護理師定期訪視照顧，請問下列給李先生的照顧處置，何者最不恰當？
A. 使用嗎啡控制嚴重疼痛
B. 尊重其宗教信仰，安排宗教師協助，以提昇靈性境界
C. 即使有嚴重惡病質（cachexia）現象，也不以大量靜脈營養輸液延長生命
D. 因癌症末期病情變化較大，家屬照顧困難，應以長期住院最合適，以免護理師奔波勞苦

正確答案：D. 因癌症末期病情變化較大，家屬照顧困難，應以長期住院最合適，以免護理師奔波勞苦